Clinical trial exclusion criterion:
Type 1 diabetes, gestational diabetes, or secondary forms of diabetes

Entity relations:
- OR("Type 1 diabetes", "secondary forms of diabetes", "gestational diabetes")